Clinical trial exclusion criterion:
Obesity defined as BMI>30

Entity relations:
- AND("Obesity", "BMI")
- Has_value("BMI", ">30")